Clinical trial exclusion criterion:
Subjects who are diagnosed as suffering from psychotic illness according to DSM-IV (Axis 1)22, or with a history of CNS disease, a history of infection that might affect CNS (HIV, syphilis, cytomegalovirus, herpes), or a history of head injury with loss of consciousness,pregnant women.

Annotated entities:
- Condition: "psychotic illness"
- Measurement: "DSM-IV"
- Qualifier: "Axis 1"
- Temporal: "history"
- Condition: "CNS disease"
- Temporal: "history"
- Condition: "infection"
- Qualifier: "affect CNS"
- Condition: "HIV"
- Condition: "syphilis"
- Condition: "cytomegalovirus"
- Condition: "herpes"
- Temporal: "history"
- Condition: "head injury"
- Condition: "loss of consciousness"
- Condition: "pregnant"